Clinical trial exclusion criterion:
Subjects who currently participate in other clinical trial or participated in other clinical trial within 30 days

Annotated entities:
- Non-query-able: "Subjects who currently participate in other clinical trial or participated in other clinical trial within 30 days"
- Context_Error: "Subjects who currently participate in other clinical trial or participated in other clinical trial within 30 days"